下列敘述何者錯誤？
A. agonist 與 allosteric inhibitor 同時存在之下，其效用會比單獨 agonist 存在之效用低
B. 當 antagonist 與 agonist 作用於相同位置，稱之為 competitive inhibitor
C. agonist 與 competitive inhibitor 同時存在之下，不論劑量多大，其效用會比單獨 agonist 存在之效用低
D. agonist 與 allosteric activator 同時存在之下，其效用會比單獨 agonist 存在之效用高

正確答案：C. agonist 與 competitive inhibitor 同時存在之下，不論劑量多大，其效用會比單獨 agonist 存在之效用低